Clinical trial inclusion criterion:
1. Angina or equivalent symptoms > 20 min and

Annotated entities:
- Condition: "Angina"
- Condition: "Angina symptoms"
- Temporal: "> 20 min"